Multiple significant trauma (i.e. significant intracranial and extracranial injuries including limb fractures) that would limit observation of recovery from spinal cord injury

The above is a clinical trial exclusion criterion. Annotated with entity spans:
[Qualifier: Multiple] [Qualifier: significant] [Condition: trauma] (i.e. significant [Condition: intracranial] and [Condition: extracranial injuries] including [Condition: limb fractures]) that would limit observation of recovery from spinal cord injury